一位42歲女性病人之血液報告呈現HBsAg：陽性、anti-HBs antibody IgG：陽性。下列何者之判斷最合理？
A. 此病人仍為B型肝炎帶原者
B. 此病人非B型肝炎帶原者，因為已有陽性之anti-HBs
C. 實	檢	錯誤，HBsAg與anti-HBs不可能均為陽性
D. 宜加作anti-HBc antibody（anti-HBc），才可作判定

正確答案：A. 此病人仍為B型肝炎帶原者